Clinical trial exclusion criterion:
Inadequate RBC mass based on TBV <4500 ml (above) or screening Hb <14 g/dL

Annotated entities:
- Observation: "RBC mass"
- Qualifier: "Inadequate"
- Measurement: "TBV"
- Value: "<4500 ml"
- Measurement: "Hb"
- Value: "<14 g/dL"